Clinical trial exclusion criteria:
Amiodarone
P-glycoprotein (P-gp) inducers (e.g., rifampin, St. John's wort)
Liver biopsy at any time showing mHAI stage 4 or higher fibrosis OR
FibroScan within 12 months demonstrating liver stiffness of =9.5 kilo Pascal or
AST to platelet ratio index (APRI) =2.0 and Fibrosis-4 (FIB-4) =3.25
NOTE: If APRI and FIB-4 are discordant one of the other forms of fibrosis staging must be used.
Known allergy/sensitivity or any hypersensitivity to components of study drugs or their formulation.
Hemochromatosis
Alpha-1 antitrypsin deficiency
Wilson's disease
Autoimmune hepatitis
Alcoholic liver disease
Drug-related liver disease
Severe NC confounding conditions (stroke, head injury, or developmental learning disability).
Regular use of anti-inflammatory drugs.
Current or recent treatment with pegylated interferon (PEG-IFN).
Other active inflammatory process (major infection, malignancy, rheumatoid arthritis/autoimmune disorder) within the prior 28 days.
Contraindications to magnetic resonance imaging (MRI).
Bleeding diathesis, thrombocytopenia, or use of anticoagulants that would contraindicate lumbar puncture.
Uncontrolled or active depression or other psychiatric disorder that in the opinion of the site investigator might preclude adherence to study requirements or impact NC functioning and assessments.
Active drug or alcohol use or dependence that, in the opinion of the site investigator, would interfere with adherence to study requirements.
Presence of active or acute AIDS-defining opportunistic infections within 12 weeks prior to study entry.

Annotated entities:
- Drug: "Amiodarone"
- Drug: "P-glycoprotein (P-gp) inducers"
- Drug: "rifampin"
- Drug: "St. John's wort"
- Procedure: "Liver biopsy"
- Measurement: "mHAI stage"
- Value: "4 or higher"
- Temporal: "any time"
- Procedure: "FibroScan"
- Temporal: "within 12 months"
- Measurement: "liver stiffness"
- Value: "=9.5 kilo Pascal"
- Measurement: "AST to platelet ratio index (APRI)"
- Value: "=2.0"
- Measurement: "Fibrosis-4 (FIB-4)"
- Value: "=3.25"
- Non-representable: "NOTE: If APRI and FIB-4 are discordant one of the other forms of fibrosis staging must be used."
- Condition: "allergy"
- Condition: "sensitivity"
- Condition: "hypersensitivity"
- Drug: "components of study drugs"
- Condition: "Hemochromatosis"
- Condition: "Alpha-1 antitrypsin deficiency"
- Condition: "Wilson's disease"
- Condition: "Autoimmune hepatitis"
- Condition: "Alcoholic liver disease"
- Condition: "Drug-related liver disease"
- Condition: "stroke"
- Condition: "head injury"
- Condition: "developmental learning disability"
- Condition: "NC confounding conditions"
- Drug: "anti-inflammatory drugs"
- Drug: "pegylated interferon"
- Drug: "PEG-IFN"
- Procedure: "treatment"
- Temporal: "recent"
- Temporal: "Current"
- Condition: "active inflammatory process"
- Qualifier: "Other"
- Condition: "major infection"
- Condition: "malignancy"
- Condition: "rheumatoid arthritis"
- Condition: "autoimmune disorder"
- Temporal: "within the prior 28 days"
- Procedure: "magnetic resonance imaging (MRI)"
- Condition: "Contraindications"
- Condition: "Bleeding diathesis"
- Condition: "thrombocytopenia"
- Drug: "anticoagulants"
- Condition: "contraindicate"
- Procedure: "lumbar puncture"
- Temporal: "active"
- Qualifier: "Uncontrolled"
- Condition: "depression"
- Condition: "psychiatric disorder"
- Qualifier: "other"
- Condition: "alcohol use or dependence"
- Condition: "drug use or dependence"
- Temporal: "Active"
- Temporal: "acute"
- Temporal: "active"
- Condition: "AIDS-defining opportunistic infections"
- Temporal: "within 12 weeks prior to study entry"